¿Cuál de los siguientes heterociclos se considera bioisóstero del sistema catecólico?:
1. Piridina.
2. Indol.
3. Tetrazol.
4. Tiofeno.
5. Benzimidazol.

Respuesta correcta: 5. Benzimidazol.